Patients with paraspinal extension of disease with visceral involvement.

The above is a clinical trial exclusion criterion. Annotated with entity spans:
Patients with [Condition: paraspinal extension of disease] with [Condition: visceral involvement].